Clinical trial exclusion criterion:
history of vertiginous disease; Ménière, Vertiginous migraine, atypical BPPV

Entity relations:
- OR("vertiginous disease", "Ménière", "Vertiginous migraine", "atypical BPPV")